Fluoxetine 與 MAOI 併用不會產生下列何種副作用？
A. tremor
B. sexual dysfunction
C. insomnia
D. constipation

正確答案：D. constipation